Clinical trial exclusion criterion:
Has clinically apparent ascites on physical examination

Annotated entities:
- Condition: "ascites"